Clinical trial inclusion criterion:
Couple must have been in a new relationship that started no more than six months prior to study entry

Annotated entities:
- Observation: "new relationship"
- Temporal: "no more than six months prior to study entry"